Clinical trial exclusion criterion:
Current treatment with antiplatelet therapy

Annotated entities:
- Procedure: "antiplatelet therapy"
- Temporal: "Current"